Clinical trial exclusion criterion:
9. Subjects with clinical symptoms or signs of gastrointestinal obstruction and/or who require drainage gastrostomy tube and/or parenteral hydration or nutrition.

Entity relations:
- OR("clinical symptoms of gastrointestinal obstruction", "parenteral nutrition", "parenteral hydration", "signs of gastrointestinal obstruction", "drainage gastrostomy tube")